Con respecto al músculo esquelético, elija la opción correcta:
1. En reposo, el músculo solo tiene ATP suficiente para mantener la contracción durante unos segundos.
2. La creatina fosfato es una molécula con un potencial de transferencia de fosforilos bajo.
3. Durante un ejercicio intenso, la lactato deshidrogenasa oxida el piruvato en exceso a lactato.
4. La alanina es utilizada para transportar nitrógeno y esqueletos carbonados desde el hígado al músculo.

Respuesta correcta: 1. En reposo, el músculo solo tiene ATP suficiente para mantener la contracción durante unos segundos.